Clinical trial exclusion criterion:
Patients who have already received an epidural during this admission or requiring general anesthesia for cesarean birth

Annotated entities:
- Procedure: "epidural"
- Temporal: "during this admission"
- Mood: "requiring"
- Procedure: "general anesthesia"
- Procedure: "cesarean birth"